Subject who, in the opinion of the investigator, will be noncompliant with the visit schedule or study procedures

The above is a clinical trial exclusion criterion. Annotated with entity spans:
Subject who, [Non-representable: in the opinion of the investigator], will be [Informed_consent: noncompliant with the visit schedule or study procedure]s